心臟病患者血中膽固醇（cholesterol）過高會加速動脈硬化，因此須服用降膽固醇藥物 statin。下列何者為 statin 最主要之作用機制？
A. Statin 抑制腸道 cholesterol transporter 基因表現
B. Statin 抑制 HMG-CoA reductase
C. Statin 抑制 low-density lipoprotein receptor 基因表現
D. Statin 抑制肝臟膽酸之合成

正確答案：B. Statin 抑制 HMG-CoA reductase